Los diseños de cuadrado latino son un tipo de:
1. Diseños aleatorios.
2. Diseños de bloques.
3. Diseños intra-sujetos.
4. Diseños mixtos.
5. Diseños unifactoriales.

Respuesta correcta: 2. Diseños de bloques.